En una determinación de la actividad de un enzima, el agotamiento del sustrato:
1. Es imprescindible para la mayoría de ensayos.
2. Puede dar resultados falsamente bajos en sueros con elevada actividad enzimática.
3. Ocurre cuando se termina el reactivo.
4. Se presenta por un defecto del espectrofotómetro.
5. Puede dar lugar a resultados falsamente elevados en sueros con elevada actividad enzimática.

Respuesta correcta: 2. Puede dar resultados falsamente bajos en sueros con elevada actividad enzimática.